Clinical trial exclusion criterion:
known chronic diarrheal disease (celiac disease, lactose malabsorption, Inflammatory bowel diseases, incl microscopic colitis)

Entity relations:
- Subsumes("chronic diarrheal disease", "celiac disease")
- OR("celiac disease", "microscopic colitis", "lactose malabsorption", "Inflammatory bowel diseases")